Clinical trial inclusion criterion:
Albumin = 2.5 g/dL

Annotated entities:
- Measurement: "Albumin"
- Value: "= 2.5 g/dL"